Prisoners

The above is a clinical trial exclusion criterion. Annotated with entity spans:
[Person: Prisoners]